下列何者是臨床上發現單側上頜竇炎最常見的病因？
A. 感染
B. 鼻息肉
C. 腫瘤
D. 外傷

正確答案：D. 外傷